Clinical trial exclusion criterion:
Developmental delay, intellectual deficit, and/or severe educational disability resulting in some dependence for activities of daily living

Entity relations:
- AND("Developmental delay", "dependence for activities of daily living")
- OR("Developmental delay", "intellectual deficit", "evere educational disability")